下列那一種肌細胞收縮會最快產生疲勞（fast rate of fatigue）？
A. cardiac muscle
B. smooth muscle fibers
C. fast-oxidative glycolytic fibers
D. fast-glycolytic fibers

正確答案：D. fast-glycolytic fibers